Paciente de 54 años que ingresa por fiebre termometrada de 38ºC en los cinco días previos y disnea de reposo (NYHA IV) que apareció 6 horas antes de acudir al hospital. En urgencias la exploración es compatible con insuficiencia cardiaca y el ECG muestra bloqueo auriculoventricular completo con una frecuencia ventricular de escape de 45 lpm. Los signos de insuficiencia cardiaca son refractarios al tratamiento médico y la ecocardiografía transesofágica realizada muestra una válvula aórtica con orificio regurgitante efectivo de 0.5 cm2. Los cultivos seriados son positivos para Streptococcus gallolyticus. Indique la actitud más acertada:
1. Cirugía cardiaca de reemplazo valvular aórtico por prótesis mecánica con terapia antibiótica según antibiograma.
2. Terapia antibiótica según antibiograma e implantación de balón de contrapulsación intra-aórtico y marcapasos transitorio hasta 3 semanas, tras las cuales se implantará marcapasos definitivo.
3. Implantación de marcapasos transitorio, terapia antibiótica según antibiograma e implantación percutánea de prótesis valvular aórtica.
4. Implantación urgente de marcapasos definitivo con terapia antibiótica según antibiograma durante 6 semanas.

Respuesta correcta: 1. Cirugía cardiaca de reemplazo valvular aórtico por prótesis mecánica con terapia antibiótica según antibiograma.